一位 9 個月男嬰，目前不會翻身、不會坐、會對人笑，無 Moro reflex 及 grasp reflex，有 parachute reflex，下列敘述何者錯誤？
A. 若出生週數為 28 週則有可能仍是在正常發展範圍
B. 理學檢查發現有肌肉低張力時應排除 spinal muscular atrophy 之可能性
C. 此嬰兒有不正常之反射動作表現
D. 要定期作生長發育追蹤

正確答案：C. 此嬰兒有不正常之反射動作表現